下列有關脊椎基底動脈系統之敘述，何者錯誤？
A. 脊椎動脈是起源於主動脈弓
B. 後大腦動脈部位之缺血性腦中風會造成視野缺損
C. 中腦部位之血流供應主要是來自基底動脈
D. 後交通動脈主要是連接內頸動脈系統及後大腦動脈

正確答案：A. 脊椎動脈是起源於主動脈弓